隨著老年人口的增加，尿失禁（urine incontinence）的發生率越來越高，尤其在婦女停經後。下列有關尿失禁的臨床評估，何者錯誤？
A. 病史詢問中應包括是否有糖尿病、神經系統疾病或泌尿道問題
B. 身體檢查應包括認知功能和第二及第三薦椎神經檢查
C. 殘餘尿量（postvoid-residual volume）大於 100 mL，尿流速大於 15 mL/秒，表示膀胱排空能力障礙
D. 殘餘尿量小於 100 mL，尿流速小於 10 mL/秒，表示尿道阻塞

正確答案：C. 殘餘尿量（postvoid-residual volume）大於 100 mL，尿流速大於 15 mL/秒，表示膀胱排空能力障礙